Clinical trial inclusion criterion:
Has at least one HIV-infected sexual partner for =4 weeks.

Entity relations:
- AND("sexual partner", "HIV-infected")
- Has_multiplier("sexual partner", "at least one")
- Has_value("sexual partner", "=4 weeks")